Clinical trial inclusion criterion:
Pregnant gestational age >= 28 weeks

Entity relations:
- Has_value("gestational age", ">= 28 weeks")